Clinical trial exclusion criterion:
taken of corticosteroid in the last month

Annotated entities:
- Drug: "corticosteroid"
- Temporal: "last month"